What is marked by DNaseI hypersensitive sites?

DNaseI hypersensitive sites correspond to regions of the genome that have recently been isolated as well as specific genomic regulatory regions.